Clinical trial inclusion criterion:
Cohort 2: Newly-diagnosed high-grade glioma (World Health Organization [WHO] grade 3 or 4)

Annotated entities:
- Condition: "high-grade glioma"
- Measurement: "World Health Organization [WHO] grade"
- Value: "3 or 4"